Clinical trial exclusion criterion:
Any surgical or medical condition which might significantly alter the absorption, distribution, metabolism, or excretion of study drugs, including, but not limited to, any of the following: History of active inflammatory bowel disease during the 12 months. Active duodenal or gastric ulcers during the 3 months. Evidence of hepatic disease as determined by any one of the following: aspartate aminotransferase or alanine aminotransferase values exceeding 2x upper limit of normal, history of hepatic encephalopathy, history of oesophageal varices, or history of porto-caval shunt. Current treatment with cholestyramine or colestipol resins.

Entity relations:
- AND("alter the absorption, distribution, metabolism, or excretion", "study drugs")
- AND("surgical condition", "alter the absorption, distribution, metabolism, or excretion")
- Has_qualifier("inflammatory bowel disease", "active")
- Has_temporal("inflammatory bowel disease", "during the 12 months")
- Has_qualifier("duodenal ulcers", "Active")
- Has_temporal("duodenal ulcers", "during the 3 months")
- Has_value("aspartate aminotransferase", "exceeding 2x upper limit of normal")
- Has_temporal("hepatic encephalopathy", "history")
- Has_temporal("oesophageal varices", "history")
- Has_temporal("porto-caval shunt", "history")
- Has_temporal("treatment", "Current")
- AND("treatment", "cholestyramine resins")
- Has_mood("hepatic disease", "Evidence")
- Subsumes("hepatic disease", "treatment")
- Subsumes("surgical condition", "inflammatory bowel disease")
- OR("surgical condition", "medical condition")
- OR("duodenal ulcers", "gastric ulcers")
- OR("aspartate aminotransferase", "alanine aminotransferase")
- OR("aspartate aminotransferase", "oesophageal varices", "hepatic encephalopathy", "porto-caval shunt")
- OR("cholestyramine resins", "colestipol resins")
- OR("inflammatory bowel disease", "duodenal ulcers", "hepatic disease")